Eating Disorder (anorexia nervosa, bulimia)

The above is a clinical trial exclusion criterion. Annotated with entity spans:
[Condition: Eating Disorder] ([Condition: anorexia nervosa], [Condition: bulimia])